If the patient is a woman of child-bearing potential, she must agree to use an acceptable form of birth control for duration of study participation.

The above is a clinical trial inclusion criterion. Annotated with entity spans:
[Pregnancy_considerations: If the patient is a woman of child-bearing potential, she must agree to use an acceptable form of birth control for duration of study participation].